Clinical trial exclusion criterion:
Serious and unstable medical illnesses including cardiovascular disease and cancer.

Annotated entities:
- Condition: "medical illnesses"
- Qualifier: "Serious"
- Qualifier: "unstable"
- Condition: "cardiovascular disease"
- Condition: "cancer"